18-45 yrs old

The above is a clinical trial inclusion criterion. Annotated with entity spans:
[Value: 18-45 yrs] [Person: old]